Suspect or certainty of fetal malformation,

The above is a clinical trial exclusion criterion. Annotated with entity spans:
[Mood: Suspect] or [Mood: certainty] of [Condition: fetal malformation],